Positive Hepatitis B surface antigen test

The above is a clinical trial exclusion criterion. Annotated with entity spans:
[Value: Positive] [Measurement: Hepatitis B surface antigen test]